Clinical trial exclusion criterion:
Use of oral steroids or non-steroidal anti-inflammatory agents other than aspirin within 72 hours or 3 times the agent's half-life (whichever is longer)

Annotated entities:
- Drug: "oral steroids"
- Drug: "non-steroidal anti-inflammatory agents"
- Drug: "aspirin"
- Negation: "other than"
- Temporal: "within 72 hours"
- Temporal: "within 3 times the agent's half-life"
- Reference_point: "3 times the agent's half-life"
- Reference_point: "72 hours"